Clinical trial exclusion criterion:
Currently undergoing chemotherapy

Annotated entities:
- Procedure: "chemotherapy"